Resolution of all acute toxic effects of prior anti-cancer therapy or surgical procedures to NCI CTCAE version 4.0 grade = 1 (except alopecia or other toxicities not considered a safety risk for the patient at investigator's discretion).

The above is a clinical trial inclusion criterion. Annotated with entity spans:
[Observation: Resolution] of all [Condition: acute toxic effects] of [Qualifier: prior] [Procedure: anti-cancer therapy] or [Procedure: surgical procedure]s to [Measurement: NCI CTCAE version 4.0] [Value: grade = 1] ([Non-query-able: except alopecia or other toxicities not considered a safety risk for the patient at investigator's discretion)].